Able to complete full wrist flexion-extension bilaterally

The above is a clinical trial inclusion criterion. Annotated with entity spans:
[Mood: Able to] [Procedure: complete full wrist flexion-extension bilaterally]